presence of pulp exposure in the selected tooth

The above is a clinical trial exclusion criterion. Annotated with entity spans:
presence of [Condition: pulp exposure] in the [Qualifier: selected tooth]